Allergy to levetiracetam.

The above is a clinical trial exclusion criterion. Annotated with entity spans:
[Condition: Allergy] to [Drug: levetiracetam].